Clinical trial exclusion criterion:
Females of child bearing potential who are pregnant, breast-feeding or intend to become pregnant.

Annotated entities:
- Pregnancy_considerations: "Females of child bearing potential who are pregnant, breast-feeding or intend to become pregnant"